Clinical trial exclusion criterion:
history of uterine surgery

Annotated entities:
- Temporal: "history"
- Procedure: "uterine surgery"